Clinical trial exclusion criterion:
Significant illness, trauma or surgical procedures.

Annotated entities:
- Condition: "illness"
- Condition: "trauma"
- Procedure: "surgical procedures"
- Qualifier: "Significant"
- Subjective_judgement: "Significant"